有關糖尿病口服藥物的敘述，下列何者錯誤？
A. Metformin單獨使用不太會引起低血糖，其最嚴重的副作用為乳酸血症
B. Thiazolidinediones及dipeptidyl-peptidase IV inhibitors可能會引起心臟衰竭
C. Dapagliflozin及empagliflozin屬於胰島素增敏劑
D. Acarbose的作用機轉為抑制腸道的碳水化合物消化與吸收

正確答案：C. Dapagliflozin及empagliflozin屬於胰島素增敏劑